What is PPROM?

spontaneous preterm premature rupture of fetal membranes (PPROM).